氣喘病童因急性氣喘發作至急診室時，下列處置何者最不適當？
A. 給予氧氣（O2）吸入
B. 給予吸入型短效支氣管擴張劑（short-acting β2 agonist）
C. 給予吸入型類固醇（inhaled corticosteroid）
D. 給予吸入型抗膽鹼藥物（inhaled anticholinergics）

正確答案：C. 給予吸入型類固醇（inhaled corticosteroid）